St.p. surgery with opening the uterine cavity (incl. caesarean section)

The above is a clinical trial exclusion criterion. Annotated with entity spans:
[Condition: St.p.] [Procedure: surgery with opening the uterine cavity] (incl. [Procedure: caesarean section])